Clinical trial exclusion criterion:
Patients weighing <55kgs.

Annotated entities:
- Measurement: "weighing"
- Value: "<55kgs"